Clinical trial inclusion criterion:
Normal uterine cavity

Annotated entities:
- Condition: "uterine cavity"
- Qualifier: "Normal"